下列何類藥物噴劑是急診室治療急性氣喘的第一線用藥？
A. chromones
B. glucocorticoids
C. β2-agonists
D. leukotriene modulators

正確答案：C. β2-agonists